Clinical trial inclusion criterion:
The presence of signed and dated informed consent to participate in a clinical study;

Annotated entities:
- Non-query-able: "The presence of signed and dated informed consent to participate in a clinical study;"